Clinical trial inclusion criterion:
Controls (without a history of TBI):

Annotated entities:
- Parsing_Error: "Controls (without a history of TBI):"